Clinical trial inclusion criterion:
Must agree to have regular clinic visits (minimum 3-4 per year for SA, 1-2 for mild-moderate asthma).

Annotated entities:
- Post-eligibility: "Must agree to have regular clinic visits (minimum 3-4 per year for SA, 1-2 for mild-moderate asthma)."